Is pregnant, planning pregnancy or breast feeding (female subjects of childbearing potential must have negative pregnancy test prior to vaccination).

The above is a clinical trial exclusion criterion. Annotated with entity spans:
Is [Condition: pregnant], [Mood: planning pregnancy] or [Observation: breast feeding] ([Person: female] subjects of [Observation: childbearing potential] must have [Value: negative] [Measurement: pregnancy test] [Temporal: prior to vaccination]).